下列何種神經疾病是因 very long chain fatty acid 代謝問題所導致的？
A. sphingolipidoses
B. metachromatic leukodystrophy
C. adrenoleukodystrophy
D. globoid cell leukodystrophy

正確答案：C. adrenoleukodystrophy